Clinical trial exclusion criterion:
Drug allergies to quinine sulfate or rosiglitazone

Annotated entities:
- Condition: "allergies"
- Drug: "quinine sulfate"
- Drug: "rosiglitazone"